Hypnotic medication prescribed or approved by the study physician, (up to a three doses per week) for insomnia, as long if not the night before a PET/MRI or clinic ratings visit. Antipsychotic medications, whether prescribed for sleep or other indications, are prohibited.

The above is a clinical trial exclusion criterion. Annotated with entity spans:
[Drug: Hypnotic medication] prescribed or approved by the study physician, (up to a three doses per week) for [Condition: insomnia], as long if [Negation: not] [Temporal: the night before a PET/MRI or clinic ratings visit.] [Drug: Antipsychotic medications], whether prescribed for sleep or other indications, are prohibited.